52 歲男性肝硬化合併腹水之病人因腹部鈍痛及發燒 2 天由急診住院。病人無咳嗽症狀。住院後抽血檢查白血球 7,200/μL，其中中性白血球帶狀（band）3%、分節（segment）90%、淋巴球（lymphocyte）6%、單核白血球（monocyte）1%，血紅素為 8.2 g/dL，血小板 73,000/μL。AST（aspartate aminotransferase） 52 U/L，ALT（alanine aminotransferase）28 U/L，全膽紅素（total bilirubin）為 3.4 mg/dL。尿檢查結果為紅血球 0-3/HP，白血球 0-2/HP。抽取腹水檢查結果為黃色混濁腹水，白血球 7,735/μL，其中中性白血球之 segment 86%、淋巴球（lymphocyte）0%、單核白血球（monocyte）14%。病人經抗生素治療 1 天後退燒並且腹痛大幅改善。下列何者為此住院病人之最佳臨床診斷？
A. 十二指腸潰瘍穿孔
B. 自發性細菌性腹膜炎
C. 結核性腹膜炎
D. 尿路感染

正確答案：B. 自發性細菌性腹膜炎